Clinical trial exclusion criterion:
Unable to communicate because of severe hearing loss or speech disorder

Entity relations:
- Subsumes("severe hearing loss", "Unable to communicate")
- OR("severe hearing loss", "speech disorder")